Clinical trial exclusion criterion:
Posterior segment diseases requiring a treatment or threatening the visual prognosis

Annotated entities:
- Condition: "Posterior segment diseases"
- Procedure: "treatment"
- Condition: "threatening the visual prognosis"
- Mood: "requiring"